Subjects who have participated on any other research clinical trials on the last 40 days

The above is a clinical trial exclusion criterion. Annotated with entity spans:
[Competing_trial: Subjects who have participated on any other research clinical trials on the last 40 days]